Clinical trial inclusion criterion:
RASS score between 0 and -4

Annotated entities:
- Measurement: "RASS score"
- Value: "between 0 and -4"